下列何種細胞激素是由 Th1 細胞所分泌？
A. IFN-γ
B. IL-4
C. IL-9
D. IL-13

正確答案：A. IFN-γ